Clinical trial exclusion criterion:
Allergic reactions against fish or egg proteins

Entity relations:
- AND("Allergic reactions", "fish proteins")
- OR("fish proteins", "egg proteins")